Clinical trial exclusion criterion:
institutionalized patients; alcohol consumption >60 g/day

Annotated entities:
- Person: "institutionalized"
- Observation: "alcohol consumption"
- Multiplier: ">60 g/day"